下列何種藥物不宜在急性痛風發作時使用？
A. 非類固醇消炎藥物（non-steroid anti-inflammatory drugs, NSAID）
B. 秋水仙素（colchicine）
C. 類固醇（steroids）
D. 降尿酸藥物（hypouricemic agents），如 allopurinol

正確答案：D. 降尿酸藥物（hypouricemic agents），如 allopurinol